Clinical trial exclusion criterion:
Not applicable to this follow up study

Annotated entities:
- Non-representable: "Not applicable to this follow up study"